下列自體免疫疾病中，何者侵犯不止一處組織，屬於系統性疾病？
A. 自體溶血性貧血（autoimmune hemolytic anemia）
B. 自體免疫愛迪森疾患（autoimmune Addison's disease）
C. Hashimoto's thyroiditis
D. 類風濕性關節炎（rheumatoid arthritis）

正確答案：D. 類風濕性關節炎（rheumatoid arthritis）